Clinical trial exclusion criterion:
4. Known left-sided endocarditis or prosthetic heart valve.

Entity relations:
- OR("left-sided endocarditis", "prosthetic heart valve")